Clinical trial exclusion criterion:
History of tubal ligation or hysterectomy

Entity relations:
- OR("tubal ligation", "hysterectomy")